下列何者是透明軟骨的特徵？
A. 有許多細胞間質
B. 含有豐富的微血管
C. 細胞形成同心圓排列的哈維氏系統
D. 細胞間質含鈣鹽沉積

正確答案：A. 有許多細胞間質